有關於肩關節旋轉肌袖破裂（rotator cuff tear），最容易發生在其中那一條肌肉？
A. 棘上肌（m. supraspinatus）
B. 棘下肌（m. infraspinatus）
C. 肩胛下肌（m. subscapularis）
D. 小圓肌（m. teres minor）

正確答案：A. 棘上肌（m. supraspinatus）